Type 2 diabetes

The above is a clinical trial inclusion criterion. Annotated with entity spans:
[Condition: Type 2 diabetes]